有關何杰金氏淋巴瘤（Hodgkin's lymphoma），下列何者顯示疾病分期為第三期？
A. 頸部淋巴結侵犯與體重減輕
B. 頸部淋巴結與腹股溝淋巴結侵犯
C. 脾臟腫大
D. 骨髓侵犯

正確答案：B. 頸部淋巴結與腹股溝淋巴結侵犯